Clinical trial inclusion criterion:
BV+ by Amsel criteria and Nugent score OR history of BV in the prior 6 months

Entity relations:
- multi("BV+", "BV")
- Has_temporal("BV", "in the prior 6 months")
- Has_value("Amsel criteria", "BV+")
- Has_value("Nugent score", "BV+")
- OR("Amsel criteria", "BV")
- OR("Nugent score", "BV")